diagnosis of spinal deformity

The above is a clinical trial inclusion criterion. Annotated with entity spans:
diagnosis of [Condition: spinal deformity]